Clinical trial exclusion criterion:
Treatment with cyclophosphamide, leflunomide, or methotrexate for over 2 weeks, or use of biological agent(s) regardless of duration, within the past 6 months (Note: prior use of azathioprine, mizoribine, intravenous immunoglobulins and anti-malarials is allowed).

Entity relations:
- Has_multiplier("cyclophosphamide", "2 weeks")
- Has_temporal("cyclophosphamide", "past 6 months")
- Has_negation("azathioprine", "allowed")
- OR("cyclophosphamide", "leflunomide", "methotrexate")
- OR("cyclophosphamide", "biological agent")
- OR("azathioprine", "immunoglobulins", "mizoribine", "anti-malarials")